Which is the main reason for the increase in the incidence of cryptococcal disease?

It is an increasing cause of infection in immunosuppressed patients, most notably those with HIV infection. The incidence of infection with Cryptococcus neoformans has increased four-fold in the last decade. Currently, 4.0% patients with AIDS in the United Kingdom are known to have developed cryptococcosis.